¿En qué paciente se realizaría una coronariografía urgente?
1. Mujer de 66 años diabética con un único episodio de dolor en reposo y elevación de troponinas.
2. Hombre de 77 años que ingresa por dos episodios de dolor de 30 minutos de duración con descenso del segmento ST en el ECG durante el episodio de dolor.
3. Hombre de 55 años que tras una semana de tratamiento con doble antiagregación se le realiza una ergometría isotópica que muestra isquemia extensa en la cara anterior.
4. Mujer de 65 años con dolor en reposo y ergometría positiva clínica en el tercer estadio de Bruce.
5. Paciente de 55 años que ingresa por dolor torácico y disnea saturando al 80% a pesar de la administración de oxígeno y con un ECG con descenso del ST en la cara anterolateral que no revierte con la administración de nitroglicerina intravenosa.

Respuesta correcta: 5. Paciente de 55 años que ingresa por dolor torácico y disnea saturando al 80% a pesar de la administración de oxígeno y con un ECG con descenso del ST en la cara anterolateral que no revierte con la administración de nitroglicerina intravenosa.